在兒童肱骨下端髁上骨折（supracondylar fracture）中，最常合併受損的是那一條神經？
A. 臂神經叢（brachial plexus）
B. 前骨間神經（anterior interosseous nerve）
C. 背骨間神經（dorsal interosseous nerve）
D. 尺骨神經（ulnar nerve）

正確答案：B. 前骨間神經（anterior interosseous nerve）